Clinical trial exclusion criterion:
any neurological conditions other than PD;

Annotated entities:
- Condition: "neurological conditions"
- Condition: "PD"
- Negation: "other than"